Clinical trial exclusion criterion:
Being pregnant

Annotated entities:
- Condition: "pregnant"